Clinical trial inclusion criterion:
Reports drinking a minimum of 5 standard drinks for men or 4 standard drinks for women on at least 4 days per week on average over the past 28 days

Entity relations:
- Has_value("men", "minimum of 5 standard drinks on at least 4 days per week")
- Has_value("women", "4 standard drinks on at least 4 days per week")
- AND("drinking", "men")
- Has_temporal("drinking", "over the past 28 days")
- OR("men", "women")